12 歲女學生經常發生半夜不自覺地大量流鼻血，在急診止血時最需注意那一部位？
A. 下鼻甲的後端
B. 鼻中隔的末端
C. 鼻咽部
D. 鼻中隔的前端

正確答案：D. 鼻中隔的前端